下列何者無法培養在一般的大氣中？
A. 霍亂弧菌（Vibrio cholerae）
B. 綠膿桿菌（Pseudomonas aeruginosa）
C. 志賀氏赤痢菌（Shigella dysenteriae）
D. 幽門桿菌（Helicobacter pylori）

正確答案：D. 幽門桿菌（Helicobacter pylori）